Major bleeding history or bleeding diathesis

The above is a clinical trial exclusion criterion. Annotated with entity spans:
[Qualifier: Major] [Condition: bleeding] [Temporal: history] or [Condition: bleeding diathesis]